Clinical trial inclusion criterion:
Adult (=18 years)

Annotated entities:
- Person: "Adult"
- Value: "=18 years"
- Person: "years"